Clinical trial inclusion criterion:
Is an adapted Avaira sphere contact lens wearer (at least 1 week in Avaira sphere)

Entity relations:
- Has_index("at least 1 week in Avaira sphere", "Avaira sphere")
- Has_temporal("Avaira sphere contact lens", "at least 1 week in Avaira sphere")